臀下神經（inferior gluteal nerve）受到壓迫損傷，下列何者會受影響？
A. 臀大肌
B. 臀中肌
C. 臀小肌
D. 闊筋膜張肌

正確答案：A. 臀大肌